下列何者為造成硬腦膜外出血（epidural hematoma）之最可能原因？
A. 大腦動脈環（arterial circle of cerebrum）上血管瘤破裂
B. 上頜動脈（maxillary artery）出血
C. 腦膜中動脈（middle meningeal artery）破裂
D. 大腦前動脈（anterior cerebral artery）出血

正確答案：C. 腦膜中動脈（middle meningeal artery）破裂